Clinical trial exclusion criterion:
previous treatment with follicle stimulating hormone for assisted reproduction

Entity relations:
- AND("treatment", "follicle stimulating hormone")
- AND("treatment", "assisted reproduction")
- Has_temporal("treatment", "previous")